下列何者不參與角膜反射？
A. 同側顏面神經運動核（facial motor nucleus）
B. 對側顏面神經運動核（facial motor nucleus）
C. 三叉神經脊髓核（spinal trigeminal nucleus）
D. 動眼神經核（oculomotor nucleus）

正確答案：D. 動眼神經核（oculomotor nucleus）